Entre los criterios de DSM-IV para el diagnóstico del Trastorno obsesivo compulsivo de la personalidad, están:
1. Un patrón general de preocupación por el orden, el perfeccionismo, el control mental e interpersonal a expensas de la eficacia, así como tendencia a delegar en otros tareas o trabajo.
2. Muestra rigidez y obstinación, así como tendencia a dilapidar el dinero.
3. Preocupación por los detalles, las reglas, las normas, las listas, el orden, la organización, los horarios, hasta perder de vista el objetivo principal de la actividad.
4. Dedicación laxa al trabajo y la productividad, con exclusión de las actividades de ocio, poco escrupuloso en cuestiones de moral y ética.
5. Tendencia a deshacerse de los objetos inútiles, aunque tengan un valor sentimental. Estilo avaro en cuanto a los gastos, tanto para él como para los demás.

Respuesta correcta: 3. Preocupación por los detalles, las reglas, las normas, las listas, el orden, la organización, los horarios, hasta perder de vista el objetivo principal de la actividad.